李先生，50 歲，有慢性咳嗽病史，近來出現全身無力、噁心、厭食，甚至嘔吐之情形。前晚出現明顯的視幻覺，看到一堆穿紅衣的小孩向他要錢，但第二天卻大部分不記得，則李先生最可能得了下列何種疾病或狀況？
A. 血糖降低
B. 血鈉降低
C. 嚴重型憂鬱症
D. 妄想症

正確答案：B. 血鈉降低